下列何種藥物主要抑制腸細胞對cholesterol攝取作用，可與statin類藥物合用，以降低LDL之加成藥效？
A. Gemfibrozil
B. Niacin
C. Ezetimibe
D. Cholestyramine

正確答案：C. Ezetimibe